有關古柯鹼（Cocaine）所造成的急性冠心症時，下列那一種藥物是禁忌？
A. Diazepam（benzodiazepine類藥物）
B. Morphine（鴉片類藥物）
C. Phentolamine（α-腎上腺阻斷劑）
D. Propranolol（β-腎上腺阻斷劑）

正確答案：D. Propranolol（β-腎上腺阻斷劑）